Patients are on no other anti-diabetic drug treatment, or on stable maximum 3000 mg daily dose metformin treatment and/or on stable dose of a DPPIV inhibitor treatment for at least the last 3 months5. HbA1c levels =6.0% (=42 mmol/mol) and =9.0% (75 mmol/mol).

The above is a clinical trial inclusion criterion. Annotated with entity spans:
Patients are on [Negation: no] [Qualifier: other] [Procedure: anti-diabetic drug treatment], or on [Qualifier: stable] [Multiplier: maximum 3000 mg daily dose] [Drug: metformin] treatment and/or on [Qualifier: stable dose] of a [Drug: DPPIV inhibitor] treatment [Temporal: for at least the last 3 months]5. [Measurement: HbA1c levels] [Value: =6.0%] ([Value: =42 mmol/mol]) and [Value: =9.0%] ([Value: 75 mmol/mol]).